pancreatic polypeptide producing endocrine tumor

The above is a clinical trial exclusion criterion. Annotated with entity spans:
[Condition: pancreatic polypeptide producing endocrine tumor]